有關 exenatide 降血糖的作用之敘述，下列何者錯誤？
A. 降低餐後血糖
B. 活化 peroxisome proliferator-activated receptor-γ（PPAR-γ）受體
C. 降低食慾
D. 增加葡萄糖所誘導的胰島素釋放作用

正確答案：B. 活化 peroxisome proliferator-activated receptor-γ（PPAR-γ）受體